Clinical trial exclusion criterion:
BMI>=35kg/m2

Entity relations:
- Has_value("BMI", ">=35kg/m2")